在診斷腕隧道症候群（carpal tunnel syndrome）時，下列何種電學診斷方法最有早期診斷價值？
A. 神經傳導（nerve conduction）檢查
B. 肌電圖（electromyography）檢查
C. 連續電刺激神經（repetitive nerve stimulation）檢查
D. 體感神經誘發電位（somatosensory evoked potential）檢查

正確答案：A. 神經傳導（nerve conduction）檢查